Response assessment of complete response (CR), partial response (PR), long stable disease (SD) for >3 months with a cancer immunotherapy treatment for metastatic cancer or hematologic malignancies either through a marketed CPI or through participation in a Roche/Genentech CPI clinical trial.

The above is a clinical trial inclusion criterion. Annotated with entity spans:
[Measurement: Response assessment] of [Value: complete response (CR)], [Value: partial response (PR)], [Value: long stable disease (SD)] [Temporal: for >3 months] with a [Qualifier: cancer] [Procedure: immunotherapy treatment] for [Condition: metastatic cancer] or [Condition: hematologic malignancies] either through a [Procedure: marketed CPI] or through [Observation: participation in a Roche/Genentech CPI clinical trial].